Clinical trial exclusion criterion:
Pregnant and lactating women, women who plan to become pregnant, or women of child bearing age not using reliable contraceptive measures.

Annotated entities:
- Pregnancy_considerations: "Pregnant and lactating women, women who plan to become pregnant, or women of child bearing age not using reliable contraceptive measures."